下列何者並非診斷全身性發炎反應症候群（systemic inflammatory response syndrome）的準則？
A. 發燒（口溫超過 38℃）或體溫過低（小於 36℃）
B. 呼吸次數每分鐘超過 24 次
C. 心跳次數每分鐘超過 90 次
D. 血液培養出細菌

正確答案：D. 血液培養出細菌